一位因中風長期臥床之病友，平日由看護自製流質飲食經鼻胃管餵食。一個月前更換看護 後，家人發現病友尾骶骨（sacrum）附近長出一個直徑3公分之壓瘡（pressure sore）。一個月來雖然每日早晚擦藥治療、勤於翻身，傷口反而擴大為直徑8公分。此病友最不可能缺乏下列何種營養素？
A. 維生素A
B. 維生素C
C. 鋅
D. 蛋白質

正確答案：A. 維生素A